Clinical trial inclusion criteria:
Age 35-70 years old
Fasting blood glucose 100-125 mg/dL

Annotated entities:
- Person: "Age"
- Value: "35-70 years old"
- Measurement: "Fasting blood glucose"
- Value: "100-125 mg/dL"